李先生 78 歲，因吸入性肺炎併發急性呼吸窘迫症候群，在加護病房接受呼吸器治療，使用 pressure control mode，住院第三天晚上，李先生突然呼吸急迫，且呼吸器響起低潮氣量警告，呼吸治療師立即確認人工氣道和呼吸器功能正常，則下列何者為正確處理？
A. 詳細胸部聽診
B. 緊急胸部 X 光攝影
C. 抽取動脈血液氣體分析
D. 安排核醫肺部灌流掃描

正確答案：A. 詳細胸部聽診